促性腺激素（gonadotrophins）分泌不足時，性腺機能不足（idiopathic hypogonadotropic hypogonadism）病人之睪丸結構，缺少下列何種細胞？
A. 內皮細胞（endothelial cells）
B. 睪丸支持細胞（Sertoli cells）
C. 睪丸間質細胞（Leydig cells）
D. 精細管周類肌細胞（peritubular myoid cells）

正確答案：C. 睪丸間質細胞（Leydig cells）